下列疾病以及其致病原的組合，何者正確？
A. 萊姆病（lyme disease）：Leptospira interrogans
B. 百日咳（pertussis）：Borrelia burgdorferi
C. 貓抓熱（cat-scratch disease）：Bartonella henselae
D. 恙蟲病（scrub typhus）：Coxiella burnetii

正確答案：C. 貓抓熱（cat-scratch disease）：Bartonella henselae